Type I diabetic patients

The above is a clinical trial inclusion criterion. Annotated with entity spans:
[Condition: Type I diabetic] patients